Clinical trial inclusion criterion:
Male or female who is among 20 to 80 years of age at screening.

Annotated entities:
- Person: "Male"
- Person: "female"
- Value: "20 to 80 years"
- Person: "age"
- Temporal: "at screening"